Orteronel was developed for treatment of which cancer?

Orteronel was developed for treatment of castration-resistant prostate cancer.